在人類細胞中，DNA複製（DNA replication）時是以何種物質為初始引子（primer）？
A. DNA
B. RNA
C. 蛋白質
D. 不需引子

正確答案：B. RNA